Maternal history of placental abruptio

The above is a clinical trial exclusion criterion. Annotated with entity spans:
[Temporal: Maternal history of] [Condition: placental abruptio]